Clinical trial inclusion criterion:
Female age 20-50 y/o who plan to undergo abdominal myomectomy for symptomatic myomatous uterus

Annotated entities:
- Person: "Female"
- Person: "age"
- Value: "20-50 y/o"
- Mood: "plan to undergo"
- Procedure: "abdominal myomectomy"
- Qualifier: "symptomatic"
- Condition: "myomatous uterus"